Clinical trial inclusion criterion:
diabetes mellitus type 1

Annotated entities:
- Condition: "diabetes mellitus type 1"